dysautonomia

The above is a clinical trial exclusion criterion. Annotated with entity spans:
[Condition: dysautonomia]